irreversible status of primary disease

The above is a clinical trial exclusion criterion. Annotated with entity spans:
[Qualifier: irreversible status] of [Condition: primary disease]